Clinical trial exclusion criterion:
Evidence of an active gastrointestinal or urogenital bleeding

Entity relations:
- Has_temporal("gastrointestinal bleeding", "active")
- OR("gastrointestinal bleeding", "urogenital bleeding")